Clinical trial inclusion criterion:
Stable pharmacological therapy during the last 4 weeks (with the exception of diuretics)

Entity relations:
- Has_qualifier("pharmacological therapy", "Stable")
- Has_index("during the last 4 weeks", "last 4 weeks")
- Has_negation("diuretics", "with the exception of")
- AND("pharmacological therapy", "diuretics")
- Has_temporal("pharmacological therapy", "during the last 4 weeks")